Clinical trial inclusion criterion:
All adult patients with chronic myeloid leukaemia in any phase (chronic, accelerated or blastic) who undergo allogeneic stem cell transplantation between 01/01/2010 and 30/09/2013 and have been previously treated with Nilotinib or Dasatinib, regardless of their response to these drugs.

Annotated entities:
- Condition: "chronic myeloid leukaemia"
- Procedure: "allogeneic stem cell transplantation"
- Temporal: "between 01/01/2010 and 30/09/2013"
- Drug: "Nilotinib"
- Drug: "Dasatinib"
- Temporal: "previously"
- Qualifier: "chronic"
- Qualifier: "accelerated"
- Qualifier: "blastic"
- Qualifier: "any phase"
- Person: "adult"